Known thrombocytopenia, contraindicating intramuscular vaccination

The above is a clinical trial exclusion criterion. Annotated with entity spans:
Known [Condition: thrombocytopenia], [Condition: contraindicating] [Procedure: intramuscular vaccination]